一位 12 歲男童主訴突發性腹痛及輕微發燒，理學檢查發現腹部壓痛明顯（guarding）。生化檢查顯示血清澱粉酶（amylase）為 620 U/L。為了確定診斷，你下一步應作下列何項檢測？
A. 再測一次血清澱粉酶
B. 糞便脂肪（fecal fat）
C. 血糖（blood sugar）
D. 血清解脂酶（lipase）

正確答案：D. 血清解脂酶（lipase）